60 歲男性，接受冠狀動脈繞道手術。術後第二天，血行動力正常，胸部X光正常，肺臟呼吸音清楚無濕囉聲，動脈血氣體分析正常，病人意識清楚，呼吸器當時的設定是SIMV mode，呼吸器通氣次數每分鐘 4 次，病人自呼 8 次，PEEP: 4 cm-H2O，敏感度 2 cm-H2O，呼吸器壓力支持 10 cm-H2O。準備讓病人脫離呼吸器，接上T型管讓病人自己呼吸，呼吸次數很快上升到每分鐘 30 次，病人自己覺得會喘，接回呼吸器並用原來呼吸器的設定，病人很快恢復，但再嘗試接回T型管，病人呼吸又變得淺快，且病人覺得不舒服。請問病人最可能的診斷為何？
A. 體液過多（fluid overload）
B. 急性心衰竭（acute heart failure）
C. 成人呼吸窘迫症（ARDS）
D. 膈神經受傷（phrenic nerve palsy）

正確答案：B. 急性心衰竭（acute heart failure）